Clinical trial inclusion criterion:
2. diagnosis of moderate to severe AT, confirmed by Dr. Wilson using clinical symptoms and exam findings consistent with chronic AT (>6 month duration) - which includes pain while palpating the intratendinous swelling part of the Achilles tendon and relief of pain when tendon placed under tension - and pre-procedure US

Annotated entities:
- Qualifier: "moderate to severe"
- Condition: "AT"
- Non-query-able: "confirmed by Dr. Wilson"
- Condition: "chronic AT"
- Temporal: ">6 month duration"
- Condition: "pain while palpating the intratendinous swelling part of the Achilles tendon"
- Condition: "relief of pain when tendon placed under tension"